下列何種細胞介質和敗血症較無相關？
A. 腫瘤壞死因子（Tumor necrosis factor）
B. 一氧化氮（Nitric oxide）
C. 血管增生因子（Angiogenin）
D. 心肌抑制物質（Myocardial depressant substance）

正確答案：C. 血管增生因子（Angiogenin）